Clinical trial exclusion criterion:
Severe renal impairment

Entity relations:
- Has_qualifier("renal impairment", "Severe")